¿Qué técnica experimental se emplea en el estudio del registro sensorial visual?:
1. El informe parcial.
2. La supresión articulatoria.
3. La técnica del sufijo.
4. El método de los ahorros.

Respuesta correcta: 1. El informe parcial.